Clinical trial inclusion criteria:
Age > 18 years
Eastern Cooperative Oncology Group score 0-2
First Diagnosed Head and neck cancer and plan for treatment with cisplatin
Serum creatinine =1.5 mg/dl or eGFR=60(ml/min/1.73 m2)

Annotated entities:
- Person: "Age"
- Value: "> 18 years"
- Measurement: "Eastern Cooperative Oncology Group"
- Value: "score 0-2"
- Condition: "Head and neck cancer"
- Mood: "plan"
- Drug: "cisplatin"
- Measurement: "Serum creatinine"
- Value: "=1.5 mg/dl"
- Measurement: "eGFR"
- Value: "=60(ml/min/1.73 m2)"